Clinical trial exclusion criterion:
History of recurrent respiratory infections (> 3 hospitalization in the last year)

Entity relations:
- Has_multiplier("respiratory infections", "recurrent")
- Has_multiplier("hospitalization", "> 3 in the last year")
- Has_temporal("respiratory infections", "History")
- Subsumes("respiratory infections", "hospitalization")